一位 24 歲男性患者，三週前出現情緒興奮，講話滔滔不絕，精力充沛，早出晚歸，用錢揮霍，愛管閒事，愛批評別人，因而與人衝突，被家人送入醫院。過去病史及體檢無異常發現。該患者最可能罹患那種精神疾患？
A. 精神分裂症（schizophrenic disorder）
B. 雙極性疾患，躁症發作（bipolar disorder, manic episode）
C. 憂鬱症（depressive disorder）
D. 反社會人格疾患（antisocial personality disorder）

正確答案：B. 雙極性疾患，躁症發作（bipolar disorder, manic episode）